Active infections

The above is a clinical trial exclusion criterion. Annotated with entity spans:
[Temporal: Active] [Condition: infections]